Clinical trial inclusion criterion:
Colonization confirmed by our microbiology department, including at least 3 positives swabs in the last month

Entity relations:
- Has_temporal("swabs", "in the last mont")
- Has_multiplier("swabs", "at least 3")
- Has_value("swabs", "positives")
- Has_qualifier("Colonization", "confirmed by our microbiology department")
- AND("Colonization", "swabs")